Clinical trial exclusion criterion:
The patient has previously received anti-tumor biological targeted therapy

Entity relations:
- Has_temporal("anti-tumor biological targeted therapy", "previously")